What does the boxed warning of pimavanserin say?

Pimavanserin bears a boxed warning about the risk of death associated with antipsychotic use in elderly patients with dementia.